Use of corticosteroids/other antithrombotic agents(warfarin)

The above is a clinical trial exclusion criterion. Annotated with entity spans:
Use of [Drug: corticosteroids]/other [Drug: antithrombotic agents]([Drug: warfarin])